En las personas vegetarianas estrictas puede aparecer carencia de una de las siguientes vitaminas:
1. Vitamina B12.
2. Vitamina C.
3. Retinol.
4. Folato.
5. Niacina.

Respuesta correcta: 1. Vitamina B12.